Clinical trial inclusion criterion:
The patient is available for 12 months of follow-up

Annotated entities:
- Post-eligibility: "The patient is available for 12 months of follow-up"